Patients with a diagnosis of glaucoma

The above is a clinical trial exclusion criterion. Annotated with entity spans:
Patients with a diagnosis of [Condition: glaucoma]